Ludwig's angina 之感染和那一條肌肉較無關係？
A. genioglossus muscle
B. geniohyoid muscle
C. mylohyoid muscle
D. digastric muscle

正確答案：D. digastric muscle